Atrial fibrillation of new onset or when rate control has been difficult

The above is a clinical trial exclusion criterion. Annotated with entity spans:
[Condition: Atrial fibrillation] of [Temporal: new onset] or when [Condition: rate control has been difficult]